Symptomatic hypotension.

The above is a clinical trial exclusion criterion. Annotated with entity spans:
[Qualifier: Symptomatic] [Condition: hypotension].